Clinical trial inclusion criterion:
19 years old and above.

Entity relations:
- Has_value("old", "19 years and above")